Serum bicarbonate <15 mmol/L

The above is a clinical trial inclusion criterion. Annotated with entity spans:
[Measurement: Serum bicarbonate] [Value: <15 mmol/L]